簡先生是一位30歲的男性，曾經做過警衛，但目前是自由業。3年前因缺血性腸炎接受大量小腸切除，術後因 為短腸症裝了希克曼氏導管長期接受全靜脈營養。對於日復一日照顧導管接點滴的工作及長年來無法正常進食感到非常厭煩。這次因為發燒，導管相關血液感染住院，最近幾天病患曾多次告訴照顧他的醫師，經過長時間的思考，他不想再活下去，他要停止目前的治療並拒絕繼續接受全靜脈營養。他說若不能正常由口進
 食，病患的生命就沒有任何意義，同時他已經與家人討論過這件事，他的家人雖然於心不忍，但卻似乎已經
 接受且同意他的想法；下列何種作法最不適當？
A. 尊重簡先生的意願，不繼續給予全靜脈營養
B. 會診精神科評估病人的心智並且探究原因
C. 為避免病人死亡，不論如何需繼續治療
D. 和病人討論各種治療之選項，尊重他的選擇

正確答案：C. 為避免病人死亡，不論如何需繼續治療